List the cancers that are associated with SBLA syndrome.

Li-Fraumeni syndrome is an autosomal dominant inherited disorder also known as the SBLA cancer syndrome (sarcoma, breast, leukemia, and adrenal). Li-Fraumeni syndrome (LFS) is characterized by a pleth